Clinical trial exclusion criterion:
Atrial fibrillation with a heart rate > 120/min.

Annotated entities:
- Condition: "Atrial fibrillation"
- Measurement: "heart rate"
- Value: "> 120/min"